What does csDMARD stand for?

csDMARDS are conventional synthetic disease-modifying antirheumatic drugs.